Clinical trial exclusion criterion:
Significant autoimmune disease including but not limited to immune cytopenias, rheumatoid arthritis, systemic lupus erythematosus, other connective tissue disorders, vasculitis, inflammatory bowel disease, severe psoriasis

Annotated entities:
- Condition: "autoimmune disease"
- Condition: "immune cytopenias,"
- Condition: "rheumatoid arthritis,"
- Condition: "systemic lupus erythematosus"
- Condition: "connective tissue disorders"
- Condition: "vasculitis"
- Condition: "inflammatory bowel disease"
- Condition: "psoriasis"
- Qualifier: "severe"